Clinical trial inclusion criterion:
MMSE (Mini Mental State Examination)score > or = 15

Annotated entities:
- Measurement: "MMSE (Mini Mental State Examination)"
- Value: "score > or = 15"